Clinical trial inclusion criterion:
Planned thoracoscopy with low probability(by surgeon estimate) of conversion to open procedure

Entity relations:
- Has_qualifier("thoracoscopy", "low probability(by surgeon estimate) of conversion to open procedure")